De los siguientes pares de moléculas de superficie, ¿cuál es el utilizado por los linfocitos T vírgenes para extravasarse al ganglio linfático?
1. CCR7 y L-selectina.
2. VCAM y L-selectina.
3. CCR7 y ICAM-1.
4. CCR9 y L-selectina.
5. CCR4 y VCAM-1.

Respuesta correcta: 1. CCR7 y L-selectina.